不屬於第一型過敏免疫反應所引發的疾病是：
A. 氣喘（asthma）
B. 異位性皮膚炎（atopic dermatitis）
C. 農夫肺病（farmer's lung）
D. 季節性鼻炎（perennial rhinitis）

正確答案：C. 農夫肺病（farmer's lung）